Clinical trial exclusion criterion:
Patients who were pregnant

Annotated entities:
- Condition: "pregnant"